Clinical trial exclusion criterion:
open abdominal surgeries except simple appendectomy and common OB/GYN procedures in the pelvis (hysterectomy, C-section, and oophorectomy, tubal ligation)

Entity relations:
- Has_qualifier("common OB/GYN procedures", "pelvis")
- Subsumes("common OB/GYN procedures", "hysterectomy")
- Has_negation("simple appendectomy", "except")
- AND("open abdominal surgeries", "simple appendectomy")
- OR("hysterectomy", "C-section", "oophorectomy", "tubal ligation")
- OR("simple appendectomy", "common OB/GYN procedures")